Age older than 30 years

The above is a clinical trial inclusion criterion. Annotated with entity spans:
[Person: Age] [Value: older than 30 years]